Clinical trial inclusion criterion:
Patients who require at least 80% of their caloric intake as PN at study start, and in whom an indication for PN is expected for at least 5 days

Entity relations:
- Has_value("PN", "at least 80% of caloric intake")
- Has_temporal("PN", "at study start")
- AND("indication", "PN")
- Has_mood("for at least 5 days", "expected")
- Has_multiplier("indication", "for at least 5 days")